Clinical trial inclusion criterion:
Patients must have adequate organ and marrow function

Entity relations:
- Has_value("organ function", "adequate")
- Has_value("marrow function", "adequate")